Underlying medical condition with survival unlikely during follow-up period

The above is a clinical trial exclusion criterion. Annotated with entity spans:
Underlying [Condition: medical condition] with [Condition: survival unlikely] during follow-up period